Clinical trial inclusion criterion:
At least 8 micturitions per 24 hours and

Annotated entities:
- Condition: "micturitions"
- Multiplier: "At least 8 per 24 hours"